Type of subject: outpatient.

The above is a clinical trial inclusion criterion. Annotated with entity spans:
Type of subject: [Visit: outpatient].